¿Qué papel desempeña la Fructosa 2,6bisfosfato en el metabolismo glucídico?:
1. Es un intermediario de la glucólisis.
2. Es un activador de la glucólisis y de la gluconeogénesis.
3. Es un activador de la glucólisis y un inhibidor de la gluconeogénesis.
4. Es un inhibidor de la glucólisis y un activador de la gluconeogénesis.

Respuesta correcta: 3. Es un activador de la glucólisis y un inhibidor de la gluconeogénesis.